Clinical trial exclusion criterion:
metal implants / objects in the body that may interfere with MRI

Annotated entities:
- Device: "metal implants"
- Device: "metal objects"
- Mood: "may interfere with"
- Procedure: "MRI"